Clinical trial exclusion criterion:
Immunosuppressive disorders or medications (including oral prednisone >10 mg daily, recent chemotherapy treatment)

Annotated entities:
- Condition: "Immunosuppressive disorders"
- Drug: "Immunosuppressive medications"
- Drug: "oral prednisone"
- Multiplier: ">10 mg daily"
- Procedure: "chemotherapy"